Clinical trial inclusion criterion:
Age =18 years

Annotated entities:
- Person: "Age"
- Value: "=18 years"